Clinical trial exclusion criterion:
Serum Aspartate Aminotransferase (AST) > triple the upper limit of the normal value range and/or

Entity relations:
- Subsumes("Serum Aspartate Aminotransferase", "AST")
- Has_value("Serum Aspartate Aminotransferase", "> triple the upper limit of the normal value range")